Clinical trial exclusion criterion:
15. History of malignancy within the last 5 years, except nonmelanoma skin cancer and cervical carcinoma in situ treated with curative intent.

Entity relations:
- Has_temporal("malignancy", "within the last 5 years")
- Has_temporal("malignancy", "History")
- Has_qualifier("treated", "curative intent")
- AND("cervical carcinoma in situ", "treated")
- Has_negation("cervical carcinoma in situ", "except")
- Has_negation("nonmelanoma skin cancer", "except")